Clinical trial inclusion criterion:
Subjects were to have no clinically significant abnormal findings on physical examination, ECG, medical history, or clinical laboratory results during screening.

Annotated entities:
- Qualifier: "clinically significant"
- Undefined_semantics: "clinically significant"
- Condition: "abnormal findings"
- Procedure: "physical examination"
- Procedure: "ECG"
- Temporal: "medical history"
- Procedure: "clinical laboratory"
- Temporal: "during screening"
- Negation: "no"